Spasticity

The above is a clinical trial exclusion criterion. Annotated with entity spans:
[Condition: Spasticity]